Clinical trial inclusion criterion:
Idiopathic thrombocytopenic purpura with platelet counts < 50,000, refractory to treatment, in relapse or steroids dependant

Entity relations:
- Has_value("platelet counts", "< 50,000")
- multi("steroids dependant", "steroids")
- multi("refractory to treatment", "treatment")
- Has_qualifier("Idiopathic thrombocytopenic purpura", "refractory to treatment")
- OR("refractory to treatment", "in relapse", "steroids dependant")